allergic to dexmedetomidine, similar active ingredients or excipients

The above is a clinical trial exclusion criterion. Annotated with entity spans:
[Condition: allergic] to [Drug: dexmedetomidine], [Drug: similar active ingredients] or [Drug: excipients]